Varus or valgus misalignment exceeding 15°;

The above is a clinical trial exclusion criterion. Annotated with entity spans:
[Condition: Varus] or [Condition: valgus misalignment] [Value: exceeding 15°];